Durante un ayuno prolongado:
1. El bajo nivel de azúcar en sangre hace decrecer la secreción de glucagón e incrementar la de insulina.
2. Disminuye la concentración de acetil-CoA.
3. El combustible principal del organismo pasa a ser los ácidos grasos y los cuerpos cetónicos.
4. Las proteínas se degradan y se reponen inmediatamente.
5. El cerebro y el corazón utilizan como combustibles los ácidos grasos.

Respuesta correcta: 3. El combustible principal del organismo pasa a ser los ácidos grasos y los cuerpos cetónicos.